Clinical trial exclusion criterion:
1. Antibiotics: clarithromycin, erythromycin, telithromycin, nafcillin, rifampin

Annotated entities:
- Parsing_Error: "1."
- Drug: "clarithromycin"
- Drug: "erythromycin"
- Drug: "telithromycin"
- Drug: "nafcillin"
- Drug: "rifampin"